Where do centromeres locate according to the Rabl orientation of eukaryotic nuclei?

The Rabl orientation is an example of the non-random arrangement of chromosomes, centromeres are grouped in a limited area near the nuclear periphery and telomeres are located apart from centromeres.